What is a SMR based BCI?

An SMR based BCI is a SensoriMotor Rhythm Based brain-Computer Interface (BCI). It is an alternative communication system between the human brain and an output device and is controlled by a sensorimotor rhythm (SMR), a type of brain wave.